Absolute neutrophil count (ANC) greater than or equal to 500/mm^3

The above is a clinical trial inclusion criterion. Annotated with entity spans:
[Measurement: Absolute neutrophil count (ANC)] [Value: greater than or equal to 500/mm^3]